Clinical trial exclusion criterion:
Hypersensitivity to perflutren, blood, blood products or albumin

Entity relations:
- AND("Hypersensitivity", "perflutren")
- OR("perflutren", "blood", "blood products", "albumin")